下列那一項病變最常見出現類澱粉血管病（amyloid angiopathy）？
A. 腎上腺白質營養不良（adrenoleukodystrophy）
B. 髓母細胞瘤（medulloblastoma）
C. Alzheimer 氏病
D. Parkinson 氏病

正確答案：C. Alzheimer 氏病